Clinical trial inclusion criterion:
All solid organ transplant recipients receiving their care at Seattle Children's Hospital

Entity relations:
- AND("solid organ transplant", "Seattle Children's Hospital")